Previously randomized and dosed in this study. This criterion does not apply to heterozygous subjects.

The above is a clinical trial exclusion criterion. Annotated with entity spans:
[Not_a_criteria: Previously randomized and dosed in this study.] [Parsing_Error: This criterion does not apply to heterozygous subjects.]